List the 5 different human immunoglobulin heavy chains.

using heavy chain specific gamma, alpha, mu, delta and epsilon